下列有關腕隧道症候群（carpal tunnel syndrome）的敘述，何者錯誤？
A. 患者夜眠時常因手掌麻痛醒來，甩動手部可以減緩症狀
B. 麻痛分布於第一、二、三指的背面
C. 手腕極度屈曲或伸展可以誘發症狀
D. 嚴重者會有拇指外展短肌之無力

正確答案：B. 麻痛分布於第一、二、三指的背面